Clinical trial exclusion criterion:
The score of the sixth item of HAMA =3

Annotated entities:
- Measurement: "score of the sixth item of HAMA"
- Value: "=3"